ACT score <20 at screening visit.

The above is a clinical trial inclusion criterion. Annotated with entity spans:
[Measurement: ACT score] [Value: <20] [Temporal: at screening visit].